下列何種型態的細胞進行第一次減數分裂會形成半倍數細胞（haploid cells）？
A. spermatogonia
B. primary spermatocyte
C. secondary spermatocyte
D. spermatid

正確答案：B. primary spermatocyte